Clinical trial exclusion criterion:
Probable noncompliance

Entity relations:
- Has_qualifier("noncompliance", "Probable")